Which mutated genes are associated with isolated ectopia lentis?

Isolated ectopia lentis (EL) is caused by mutation in genes:
1) ADAMTSL4 and 
2) Fibrillin-1 (FBN1).